下列何者與細胞對抗氧化傷害（oxidative damage）之機制無關？
A. glutathione
B. alpha-tocopherol
C. biopterin
D. catalase

正確答案：C. biopterin